Clinical trial exclusion criterion:
Chronic administration (defined as more than 14 days) of immunosuppressants or other immune-modifying drugs within six months prior to the first vaccine dose.

Annotated entities:
- Drug: "immunosuppressants"
- Drug: "other immune-modifying drugs"
- Temporal: "within six months"
- Temporal: "Chronic"
- Temporal: "more than 14 days"